What 3 disorders are commonly associated with Kaufman-McKusick syndrome?

The Kaufman-McKusick syndrome (MK 23670) AKA McKusik-Kaufman syndrome, is a rare autosomal recessive disorder characterized by the triad of hydrometrocolpos, postaxial polydactyly, and congenital heart disease